Clinical trial exclusion criterion:
Failure of treatment with methylphenidate in the past for apathy after convincing evidence of an adequate trial as judged by study physician

Annotated entities:
- Drug: "methylphenidate"
- Subjective_judgement: "as judged by study physician"